Clinical trial inclusion criteria:
English or Spanish speaking*
Emergency Department patient
Aged 18-80
Have had >4 emergency department visits within 12 months for 2 consecutive 12-month periods. Period of time can be extended by up to 6 months if incarcerated or institutionalized for ≥ 6 months.
Meet Diagnostic and Statistical Manual version IV (DSM-IV) criteria for alcohol dependence or & DSM-V criteria for alcohol use disorder, severe.
Have ≥2 days/week of heavy drinking (>4 drinks/day)
Capable of giving informed consent.

Annotated entities:
- Observation: "English speaking"
- Observation: "Spanish speaking"
- Visit: "Emergency Department"
- Person: "Aged"
- Value: "18-80"
- Multiplier: ">4"
- Visit: "emergency department visits"
- Temporal: "within 12 months"
- Temporal: "12-month periods"
- Multiplier: "2 consecutive"
- Person: "incarcerated"
- Person: "institutionalized"
- Temporal: "extended by up to 6 months"
- Qualifier: "Diagnostic and Statistical Manual version IV (DSM-IV) criteria"
- Condition: "alcohol dependence"
- Qualifier: "DSM-V criteria"
- Condition: "alcohol use disorder"
- Qualifier: "severe"
- Multiplier: "≥2 days/week"
- Condition: "heavy drinking"
- Value: ">4"
- Measurement: "drinks/day"
- Observation: "informed consent"
- Mood: "Capable of giving"